Clinical trial exclusion criterion:
Objection to blood draw or application of blood products

Annotated entities:
- Non-query-able: "Objection to blood draw or application of blood products"